Clinical trial exclusion criterion:
Known allergy or lack of response to mirtazapine.

Annotated entities:
- Condition: "allergy"
- Condition: "lack of response"
- Drug: "mirtazapine"